下列何者不是手術部位感染（surgical site infection）的危險因子（risk factors）？
A. 癌症病患接受手術
B. 病患是否⻑期吸菸
C. 術中是否輸血
D. 手術時間⻑短

正確答案：A. 癌症病患接受手術